La lámina nuclear está formada por:
1. Actina.
2. Tubulina.
3. Filamentos intermedios.
4. Fibronectina.
5. Laminina.

Respuesta correcta: 3. Filamentos intermedios.